根據DSM-IV-TR，下列何者不是雙極性疾患（bipolar disorder）與重鬱症常見共病（comorbid）的精神疾病？
A. 身體化症（somatoform disorder）
B. 酒精濫用（alcohol abuse）
C. 恐慌症（panic disorder）
D. 強迫症（obsessive-compulsive disorder）

正確答案：A. 身體化症（somatoform disorder）